Clinical trial exclusion criterion:
Known or suspected history of malignant hyperthermia

Entity relations:
- Has_temporal("malignant hyperthermia", "history")
- Has_mood("malignant hyperthermia", "Known")
- OR("Known", "suspected")